¿Cómo influye la presencia de cloruro potásico disuelto sobre la solubilidad del cloruro de plata?:
1. La solubilidad del AgCl no varía porque no tiene lugar ninguna reacción con los iones del precipitado.
2. Varía el producto de solubilidad, pero no la solubilidad del precipitado.
3. El precipitado se hace más insoluble.
4. El producto de solubilidad no varía si no aumenta la fuerza iónica de la disolución.

Respuesta correcta: 3. El precipitado se hace más insoluble.